Confiere resistencia mecánica a la matriz extracelular:
1. Metaloproteasa.
2. Colágeno.
3. Fibronectina.
4. Laminina.

Respuesta correcta: 2. Colágeno.